Para afrontar de forma directa y efectiva situaciones estresantes se puede utilizar:
1. La confrontación como estrategia centrada en la emoción.
2. El distanciamiento como estrategia centrada en el problema.
3. Estrategias centradas en el problema, como por ejemplo el apoyo social.
4. El mecanismo defensivo de la regresión.
5. La autoinculpación.

Respuesta correcta: 3. Estrategias centradas en el problema, como por ejemplo el apoyo social.